一位 65 歲男性，接受左側髖關節人工關節置換，3 天後，突發現右側下肢有腫大的情形。身體檢查時，病人心跳不規律，有心房震顫現象，右側股動脈及足背動脈脈搏都很清楚且和左側沒有差別，右小腿肌肉觸診時有腫脹感，其周圍測量起來，比左小腿大 2 公分。表皮顏色及溫度，左右兩腿沒什麼差別，將病人右腳掌作向背面彎曲（dorsiflexion）的動作時，病人右小腿的肌肉會疼痛，但左側則無此反應。依前敘述，最可能的診斷為何？
A. 人工關節手術時，傷及股靜脈造成回流阻塞
B. 心房震顫，左心室的栓塞掉到周圍血管內
C. 右側下肢深部靜脈之栓塞症
D. 可能是下肢蜂窩組織炎（Cellulitis）

正確答案：C. 右側下肢深部靜脈之栓塞症